Acceptance of home visitors

The above is a clinical trial inclusion criterion. Annotated with entity spans:
[Post-eligibility: Acceptance of home visitors]